Ongoing treatment with antidepressants

The above is a clinical trial inclusion criterion. Annotated with entity spans:
[Temporal: Ongoing] [Procedure: treatment] with [Drug: antidepressants]